• Investigational medications (30 days or 5 half-lives off drug, whichever is longer)

The above is a clinical trial exclusion criterion. Annotated with entity spans:
• [Drug: Investigational medications] ([Temporal: 30 days] or [Temporal: 5 half-lives off drug], whichever is longer)